La adcion de HBr a alquenos es:
1. Esteroselectiva.
2. Regioselectiva.
3. Enantioespecífica.
4. Enantioselectiva.

Respuesta correcta: 2. Regioselectiva.